Los potenciales postsinápticos excitadores:
1. Son de tipo todo o nada.
2. Son hiperpolarizantes.
3. Se pueden sumar.
4. Se propagan a largas distancias.
5. Presentan un periodo refractario.

Respuesta correcta: 3. Se pueden sumar.